Señale la respuesta INCORRECTA respecto al Síndrome Hemolítico Urémico (SHU):
1. El cuadro se caracteriza por la triada de anemia hemolítica microangiopática no inmune, trombocitopenia y fracaso renal agudo.
2. En algunos casos, dicho síndrome es la consecuencia de una disregulación de la vía alternativa del sistema del complemento.
3. Se acompaña de anemia hemolítica con test de Coombs positivo.
4. Los niveles altos de lactato deshidrogenasa (LDH) e indetectables de haptoglobina junto con la presencia de esquistocitos, confirman la presencia de hemólisis intravascular.

Respuesta correcta: 3. Se acompaña de anemia hemolítica con test de Coombs positivo.